Participant has a history of or current liver or renal insufficiency; significant cardiac, vascular, pulmonary, gastrointestinal, endocrine, neurologic, hematologic, rheumatologic, psychiatric, or metabolic disturbances

The above is a clinical trial exclusion criterion. Annotated with entity spans:
Participant has a [Temporal: history] of or current [Condition: liver] or [Condition: renal insufficiency]; [Qualifier: significant] [Condition: cardiac], [Condition: vascular], [Condition: pulmonary], [Condition: gastrointestinal], [Condition: endocrine], [Condition: neurologic], [Condition: hematologic], [Condition: rheumatologic], [Condition: psychiatric], or [Condition: metabolic disturbances]